Clinical trial exclusion criterion:
previous treatment with follicle stimulating hormone for assisted reproduction

Annotated entities:
- Temporal: "previous"
- Procedure: "treatment"
- Drug: "follicle stimulating hormone"
- Procedure: "assisted reproduction"